Clinical trial exclusion criterion:
Presence of severe cerebrovascular disorders (diagnosis of stroke, cerebral infarction or cerebral hemorrhage within recent 6 months)

Annotated entities:
- Qualifier: "severe"
- Condition: "cerebrovascular disorders"
- Condition: "stroke"
- Condition: "cerebral infarction"
- Condition: "cerebral hemorrhage"
- Temporal: "within recent 6 months"